有關細胞激素的功能，下列敘述何者錯誤？
A. TNF-α、IL-1、IL-6 與發燒及急性期蛋白（acute phase protein）的升高有關
B. 第二型輔助性T細胞（TH2）之所以能造成第一型過敏反應，是因為能分泌IFN-γ，而IFN-γ可以活
C. IFN-α/β 會增加細胞的 MHC class I 及 class II 表現量，可以幫助對抗病毒
D. GM-CSF 可以幫助樹突細胞的分化與生長

正確答案：B. 第二型輔助性T細胞（TH2）之所以能造成第一型過敏反應，是因為能分泌IFN-γ，而IFN-γ可以活